癌症細胞常有過度分裂繁殖之現象。治療癌症之藥物也常針對此特性。下列何種藥物可以抑制微管組合（microtubule assembly）進而妨礙有絲分裂？
A. methotrexate
B. 5-fluorouracil
C. cyclophosphamide
D. vinca alkaloids (vincristine)

正確答案：D. vinca alkaloids (vincristine)